What is the role of the positive effector of transcription (pet) in the hepatitis B virus?

This element, which we have named pet (positive effector of transcription), exerts its effect in cis in a position and orientation-dependent manner, suggesting that it may function as part of the nascent pregenome transcript.